Clinical trial exclusion criterion:
Urinary tract anomaly

Annotated entities:
- Condition: "Urinary tract anomaly"